co-morbidity: severe kidney- and/or liver disease or other gastrointestinal diseases

The above is a clinical trial exclusion criterion. Annotated with entity spans:
co-morbidity: [Qualifier: severe] [Condition: kidney]- and/or [Condition: liver disease] or other [Condition: gastrointestinal diseases]